Drug or alcohol dependence, or abuse within the past 3 months, soy-bean oil allergy

The above is a clinical trial exclusion criterion. Annotated with entity spans:
[Condition: Drug] or [Condition: alcohol dependence], or abuse [Temporal: within the past 3 months], [Condition: soy-bean oil allergy]